Intermediate risk:Gleason <or=6 & PSA<or=10 & Clinical Stage T2b OR Gleason=7 & PSA<or=10 & Clinical Stage T1b-T2b OR Gleason <or=6 & PSA > 10 & < or =20 & Clinical Stage T1b- T2b, Nx or NO, Mx or M0

The above is a clinical trial inclusion criterion. Annotated with entity spans:
[Observation: Intermediate risk]:[Measurement: Gleason] [Value: <or=6] & [Measurement: PSA][Value: <or=10] & [Measurement: Clinical Stage] [Value: T2b] OR [Measurement: Gleason][Value: =7] & [Measurement: PSA][Value: <or=10] & [Measurement: Clinical Stage] [Value: T1b-T2b] OR [Measurement: Gleason] [Value: <or=6] & [Measurement: PSA] [Value: > 10 & < or =20] & [Measurement: Clinical Stage] [Value: T1b- T2b], [Value: Nx] or [Value: NO], [Value: Mx] or [Value: M0]